Clinical trial exclusion criterion:
Less than 30 yrs of age or > 65 yrs of age

Annotated entities:
- Value: "Less than 30 yrs"
- Person: "age"
- Value: "> 65 yrs"
- Person: "age"